Clinical trial inclusion criterion:
pelvic pain

Annotated entities:
- Condition: "pelvic pain"